Clinical trial inclusion criteria:
Males or females above the age of 18
Patients undergoing laparoscopic or robotic colorectal resections

Annotated entities:
- Person: "Males"
- Person: "females"
- Value: "above the age of 18"
- Person: "age"
- Qualifier: "laparoscopic"
- Qualifier: "robotic"
- Procedure: "colorectal resections"